Clinical trial inclusion criterion:
Patients with STEMI undergoing primary PPCI

Annotated entities:
- Condition: "STEMI"
- Procedure: "primary PPCI"